Clinical trial exclusion criterion:
Receipt of any vaccine in the 4 weeks preceding each trial vaccination or planned receipt of any vaccine in the 4 weeks following each trial vaccination, except for:

Entity relations:
- Has_temporal("vaccine", "in the 4 weeks preceding each trial vaccination")
- Has_index("in the 4 weeks preceding each trial vaccination", "each trial vaccination")
- Has_mood("vaccine", "planned receipt")
- Has_temporal("planned receipt", "in the 4 weeks following each trial vaccination")
- Has_index("in the 4 weeks following each trial vaccination", "each trial vaccination")